有關糖皮質激素（glucocorticoids）所產生的副作用描述，下列何者錯誤？
A. 會透過干擾鈣離子的代謝作用，進而引起骨質疏鬆（osteoporosis）的現象
B. 具有促進成骨細胞（osteoblast）的形成及活性
C. 具有增加消化性潰瘍（peptic ulcer）發生的作用
D. 長期使用會抑制生長激素的分泌作用

正確答案：B. 具有促進成骨細胞（osteoblast）的形成及活性